Clinical trial inclusion criterion:
HBsAg-positive for more than 6 months (HBeAg-positive or HBeAg-negative).

Annotated entities:
- Measurement: "HBsAg"
- Value: "positive"
- Temporal: "more than 6 months"
- Measurement: "HBeAg"
- Value: "positive"
- Measurement: "HBeAg"
- Value: "negative"